肌皮神經（musculocutaneous nerve）穿過下列何者進入前臂？
A. 肱三頭肌（triceps brachii）
B. 肱二頭肌（biceps brachii）
C. 肱肌（brachialis）
D. 喙肱肌（coracobrachialis）

正確答案：D. 喙肱肌（coracobrachialis）